Clinical trial exclusion criterion:
Not suitable for study per clinician judgement.

Annotated entities:
- Non-query-able: "Not suitable for study per clinician judgement."